Clinical trial exclusion criterion:
Fasting plasma glucose > 7,0 mM, HbA1c > 48 mmol/mol 3 months after RYGB.

Entity relations:
- multi("RYGB", "RYGB")
- Has_index("3 months after RYGB", "RYGB")
- Has_value("HbA1c", "> 48 mmol/mol")
- Has_value("Fasting plasma glucose", "> 7,0 mM")
- Has_temporal("Fasting plasma glucose", "3 months after RYGB")
- OR("Fasting plasma glucose", "HbA1c")